Clinical trial inclusion criterion:
Premorbid IQ of over 70

Annotated entities:
- Measurement: "Premorbid IQ"
- Value: "over 70"